List the three most abundant bacterial phyla present in mouse feces.

Firmicutes
Proteobacteria 
Bacteroidetes